¿Cuáles son las características de la obnubilación de la conciencia?:
1. Total ausencia de conciencia que se produce por enfermedad o daño cerebral.
2. Estrechamiento transitorio de la conciencia, de duración variable, con amnesia de lo ocurrido durante el período.
3. Estado semejante al sueño que se acompaña de alucinaciones visuales intensas.
4. Trastorno profundo de índole cualitativa y cuantitativa con agitación psicomotora.
5. Reducción de la capacidad para identificar y reconocer el entorno con dificultades atencionales y del curso del pensamiento.

Respuesta correcta: 5. Reducción de la capacidad para identificar y reconocer el entorno con dificultades atencionales y del curso del pensamiento.